下列那項因子目前不被認為是壓力性尿失禁（stress urinary incontinence）的女性患者，在接受恥骨後尿道固定術（retropubic urethropexy）會是手術失	的危險因子？
A. 低Valsalva leak-point pressure
B. 低maximal urethral closure pressure
C. 膀胱鏡（cystoscopy）或螢光透視（fluoroscopy）檢查下發現有張開的膀胱頸（open bladder neck）
D. 高移動尿道（urethral hypermobility）

正確答案：D. 高移動尿道（urethral hypermobility）